下列關於細精管（seminiferous tubule）的敘述，何者正確？
A. 管外具有睪丸支持細胞（Sertoli cell）
B. 具有類肌細胞（myoid cell）可分泌睪固酮（testosterone）
C. 上皮屬於複合型複層上皮（complex stratified epithelium）
D. 管腔底部的細胞為成熟的精細胞（spermatid）

正確答案：C. 上皮屬於複合型複層上皮（complex stratified epithelium）